La administración de nutrición enteral en bolus está indicada cuando:
1. La fórmula es hiperosmolar.
2. El paciente presenta reflujo.
3. La administración es intermitente.
4. Se administran grandes volúmenes.
5. La administración es yeyunal.

Respuesta correcta: 3. La administración es intermitente.